hiatal hernia repair with posterior cruroplasty

The above is a clinical trial exclusion criterion. Annotated with entity spans:
[Condition: hiatal hernia] [Procedure: repair] with [Procedure: posterior cruroplasty]